Clinical trial inclusion criterion:
History of at least two moderate or severe exacerbations that required change in treatment (antibiotics, systemic steroids, hospitalization) in the last 18 months prior to date of screening , with at least one of these occurring within the last 12 months prior to screening.

Annotated entities:
- Multiplier: "at least two"
- Qualifier: "moderate"
- Qualifier: "severe"
- Condition: "exacerbations"
- Observation: "change in treatment"
- Qualifier: "required change in treatment"
- Drug: "antibiotics"
- Drug: "systemic steroids"
- Procedure: "hospitalization"
- Qualifier: "systemic"
- Temporal: "in the last 18 months prior to date of screening"
- Reference_point: "date of screening"
- Multiplier: "at least one"
- Temporal: "within the last 12 months prior to screening"
- Reference_point: "screening"
- Procedure: "treatment"